Pregnant, lactating, or intending to become pregnant during the study.

The above is a clinical trial exclusion criterion. Annotated with entity spans:
[Condition: Pregnant], [Condition: lactating], or [Mood: intending to become] [Condition: pregnant] [Temporal: during the study].